Other severe coexisting morbidity which, in the investigator's opinion, can prevent the patient from participating in the study.

The above is a clinical trial exclusion criterion. Annotated with entity spans:
Other severe [Temporal: coexisting] [Condition: morbidity] which, [Non-query-able: in the investigator's opinion, can prevent the patient from participating in the study].